Clinical trial inclusion criterion:
Single unit implant rehabilitation

Annotated entities:
- Procedure: "Single unit implant rehabilitation"